Clinical trial exclusion criterion:
Known severe renal (creatinine clearance <30ml/min) or hepatic insufficiency as well as Alanine transaminase (ALT)/aspartate transaminase (AST) elevations = 3xUpper limit normal (ULN); isolated AST-elevation is not considered an exclusion criteria from study participation

Entity relations:
- Has_value("creatinine clearance", "<30ml/min")
- Subsumes("elevations", "3xUpper limit normal (ULN)")
- Has_value("Alanine transaminase (ALT)", "elevations")
- Has_value("aspartate transaminase (AST)", "elevations")
- Subsumes("renal insufficiency", "creatinine clearance")
- Has_qualifier("renal insufficiency", "severe")
- Has_qualifier("hepatic insufficiency", "severe")
- OR("renal insufficiency", "hepatic insufficiency", "Alanine transaminase (ALT)")